關於下消化道出血（LGI bleeding）的敘述，何者錯誤？
A. 治療下消化道出血的首要目標是穩定心跳及血壓
B. 當患者的生命徵象穩定時，應該尋找出血位置
C. 手術是挽救患者唯一的治療方法
D. 血管攝影（angiography）可以用於尋找出血位置及治療

正確答案：C. 手術是挽救患者唯一的治療方法